Which MAP kinase phosphorylates the transcription factor c-jun?

An in vitro kinase assay revealed that c-Jun phosphorylation is primarily mediated via activated c-Jun N-terminal protein kinase (JNK).